Which syndrome is caused by deletion of Pds5b in mice?

Mice lacking sister chromatid cohesion protein PDS5B exhibit developmental abnormalities reminiscent of Cornelia de Lange syndrome.